A service user of the early intervention service

The above is a clinical trial inclusion criterion. Annotated with entity spans:
[Non-query-able: A service user of the early intervention service]